Which algorithm is available for computing minimal absent words using external memory?

emMAW